Clinical trial inclusion criterion:
Normal serum TSH within 12 months preceding surgery

Entity relations:
- Has_index("within 12 months preceding surgery", "surgery")
- Has_value("serum TSH", "Normal")
- Has_temporal("serum TSH", "within 12 months preceding surgery")